ALT(Alanine aminotransferase) level of liver function test exceeded 5 times of reference range

The above is a clinical trial exclusion criterion. Annotated with entity spans:
[Measurement: ALT(Alanine aminotransferase) level] of [Procedure: liver function test] [Value: exceeded 5 times of reference range]